Clinical trial inclusion criterion:
The patient is determined by a board certified neurosurgeon to have a tumor or vascular lesion that would take up fluorescein

Annotated entities:
- Condition: "tumor"
- Condition: "vascular lesion"
- Qualifier: "would take up fluorescein"
- Drug: "fluorescein"